List enzymes that removes histone modifications.

Histone deacetylases
Lysine Specific Demethylases